Clinical trial exclusion criterion:
Desiring pregnancy in the next year

Annotated entities:
- Pregnancy_considerations: "Desiring pregnancy in the next year"